Subjects were not to use any prescription medication within 14 days prior to or during the study.

The above is a clinical trial exclusion criterion. Annotated with entity spans:
Subjects were [Negation: not] to use any [Drug: prescription medication] [Temporal: within 14 days prior to] or [Temporal: during the study].